Clinical trial inclusion criterion:
Patient fulfils DSM-IV and NINCDS-ADRA criteria for probable Alzheimers disease

Entity relations:
- Has_mood("Alzheimers disease", "probable")
- Has_value("DSM-IV criteria", "fulfils")
- Has_value("NINCDS-ADRA criteria", "fulfils")
- causal("DSM-IV criteria", "Alzheimers disease")
- causal("NINCDS-ADRA criteria", "Alzheimers disease")